Patients with positive HIV status

The above is a clinical trial exclusion criterion. Annotated with entity spans:
Patients with [Value: positive] [Measurement: HIV status]